La unión de O2 a la hemoglobina:
1. Sigue una cinética hiperbólica.
2. Favorece la transición de Fe2+ a Fe3+ en el grupo hemo de la proteína.
3. Induce la desprotonación de la protéina.
4. Se facilita en         presencia de 2.3bisfosfoglicerato.
5. Se lleva a cabo mediante una interacción covalente con el Fe3+.

Respuesta correcta: 3. Induce la desprotonación de la protéina.